1. Patients ≥ 18 years-old from "Instituto Teletón Santiago" and "Hospital Clínico Mutual de seguridad".

The above is a clinical trial inclusion criterion. Annotated with entity spans:
[Parsing_Error: 1.] Patients [Value: ≥ 18 years]-old from "[Visit: Instituto Teletón Santiago]" [Grammar_Error: and] "[Visit: Hospital Clínico Mutual de seguridad]".